Clinical trial inclusion criterion:
Irritable Bowel Syndrome (IBS) (ROME III criteria): subtype with diarrhea or mixed form

Annotated entities:
- Condition: "Irritable Bowel Syndrome (IBS)"
- Qualifier: "ROME III criteria"
- Condition: "diarrhea"
- Qualifier: "mixed form"